¿Cómo se denomina la reacción adversa determinada por factores genéticos que se caracteriza por una respuesta anómala de ciertos individuos frente a un fármaco?:
1. Reacción idiosincrásica.
2. Efecto colateral.
3. Reacción alérgica.
4. Reacción de hipersensibilidad diferida.

Respuesta correcta: 1. Reacción idiosincrásica.